Clinical trial exclusion criterion:
Patients receiving medications highly bound to plasma proteins eg. Warfarin.

Entity relations:
- Subsumes("medications highly bound to plasma proteins", "Warfarin")